HER-2 belongs to what family of proteins?

Herceptin-2 belongs to the human epidermal growth factor receptor 2 (HER2) family of proteins.